¿Cuál de los siguientes antiinfecciosos es un inhibidor reversible de la monoaminooxidasa que puede dar lugar a interacciones con antidepresivos que aumenten la serotonina?
1. Neomicina.
2. Teicoplanina.
3. Linezolid.
4. Clindamicina.
5. Meropenem.

Respuesta correcta: 3. Linezolid.